Clinical trial inclusion criterion:
3. During the course of the study, from study screen until study exit - including the washout period, women of childbearing potential must use a spermicide containing barrier method of contraception in addition to their current contraceptive device. This advice should be documented in the informed consent form.

Entity relations:
- Has_temporal("contraceptive device", "current")
- Has_multiplier("spermicide containing barrier method of contraception", "in addition to")
- AND("women", "spermicide containing barrier method of contraception")
- Has_temporal("spermicide containing barrier method of contraception", "During the course of the study")
- AND("women", "childbearing potential")
- Has_temporal("contraceptive device", "During the course of the study")